Clinical trial exclusion criterion:
Skin lesions or lesions that have been biopsied previously

Entity relations:
- Has_temporal("biopsied", "previously")
- OR("Skin lesions", "lesions")